Clinical trial inclusion criterion:
Caucasian or Non-Caucasian

Annotated entities:
- Person: "Caucasian"
- Person: "Non-Caucasian"